Clinical trial exclusion criterion:
On anticoagulant therapy

Annotated entities:
- Procedure: "anticoagulant therapy"